心血管疾病的病人使用aspirin預防血栓發生，減少中風及心肌梗塞，下列敘述何者錯誤？
A. aspirin抑制cyclooxygenase
B. 可減少thromboxanes合成
C. 可減少prostaglandins合成
D. 可減少膽固醇的生合成

正確答案：D. 可減少膽固醇的生合成